Reassuring fetal health assessment (no abnormal findings in fetal assessment, see below)

The above is a clinical trial inclusion criterion. Annotated with entity spans:
[Value: Reassuring] [Measurement: fetal health assessment] ([Negation: no] [Condition: abnormal findings] in [Procedure: fetal assessment], see below)